Clinical trial exclusion criterion:
History of: craniotomy, cerebral metastases, cerebrovascular accident; current diagnosis of seizure disorder, schizophrenia, schizo-affective disorder, dementia, mental retardation, or major depression with psychotic features; or use of depot neuroleptics in last 12 months.

Annotated entities:
- Procedure: "craniotomy"
- Condition: "cerebral metastases"
- Condition: "cerebrovascular accident"
- Condition: "seizure disorder"
- Condition: "schizophrenia"
- Condition: "schizo-affective disorder"
- Condition: "dementia"
- Condition: "mental retardation"
- Condition: "major depression"
- Condition: "psychotic features"
- Drug: "depot neuroleptics"
- Temporal: "in last 12 months"
- Temporal: "History"